Clinical trial exclusion criterion:
Patients above 65 years of age ( Physiology difference)

Annotated entities:
- Person: "age"
- Value: "above 65 years"